treatment-naive patients with lymphoma

The above is a clinical trial inclusion criterion. Annotated with entity spans:
[Observation: treatment-naive] patients with [Condition: lymphoma]